What disease is treated with BIVV001?

BIVV001 fusion protein has been developed as Factor VIII replacement therapy for hemophilia A